Postnatal age 2 to 48 hours;

The above is a clinical trial inclusion criterion. Annotated with entity spans:
[Measurement: Postnatal age] [Value: 2 to 48 hours];